Clinical trial exclusion criterion:
Uncontrolled hypertension (defined as average SBP = 160 mmHg [2 readings taken at time of screening]).

Entity relations:
- Has_qualifier("hypertension", "Uncontrolled")
- Has_index("at time of screening", "screening")
- Has_value("average SBP", "= 160 mmHg")
- Has_multiplier("average SBP", "2 readings")
- Has_temporal("average SBP", "at time of screening")
- Subsumes("hypertension", "average SBP")